150 cm of height or greater

The above is a clinical trial inclusion criterion. Annotated with entity spans:
[Value: 150 cm] of [Person: height] or greater